primary total knee replacement surgery

The above is a clinical trial inclusion criterion. Annotated with entity spans:
[Qualifier: primary] [Procedure: total knee replacement surgery]